下列何者為最常造成胎兒心跳呈現變異型減速（variable decelerations）的原因？
A. 胎兒缺氧
B. 胎兒酸血症
C. 臍帶受壓迫（cord compression）
D. 胎頭受壓迫（head compression）

正確答案：C. 臍帶受壓迫（cord compression）